History of intolerance to colchicine

The above is a clinical trial exclusion criterion. Annotated with entity spans:
History of [Condition: intolerance] to [Drug: colchicine]